13. Concomitant treatment with other experimental compounds

The above is a clinical trial exclusion criterion. Annotated with entity spans:
[Parsing_Error: 13.] [Temporal: Concomitant] treatment with other [Drug: experimental compounds]